Clinical trial exclusion criterion:
A history of active hemorragge, ulcer, intestinal perforation, intestinal obstruction, or major surgery no older than 30 days;

Annotated entities:
- Qualifier: "active"
- Condition: "hemorragge"
- Condition: "ulcer"
- Condition: "intestinal perforation"
- Condition: "intestinal obstruction"
- Condition: "major surgery"
- Temporal: "no older than 30 days"